3. Clinical evidence of severe bleeding disorder. Patients with mild bleeding disorders such as type 1 von Willebrand disease, mild platelet function defects such as platelet storage pool or release defects, and patients with bleeding due to Ehlers Danlos syndrome WILL be eligible to participate in the study.

The above is a clinical trial exclusion criterion. Annotated with entity spans:
3. Clinical evidence of [Qualifier: severe] [Condition: bleeding disorder]. Patients with [Qualifier: mild] [Condition: bleeding disorders] such as [Condition: type 1 von Willebrand disease], [Condition: mild platelet function defects] such as [Condition: platelet storage pool] or release defects, and patients with [Condition: bleeding] due to [Condition: Ehlers Danlos syndrome] [Grammar_Error: WILL be eligible] to participate in the study.